Clinical trial exclusion criterion:
Known history of hypersensitivity reaction or intolerability to Ace Inh or ARB.

Annotated entities:
- Condition: "hypersensitivity reaction"
- Condition: "intolerability"
- Drug: "Ace Inh"
- Drug: "ARB"
- Temporal: "history"